Clinical trial exclusion criterion:
Evidence of recovering finger/thumb extension at 4-6 months

Annotated entities:
- Observation: "recovering extension"
- Qualifier: "finger"
- Qualifier: "thumb"
- Temporal: "at 4-6 months"